Clinical trial inclusion criterion:
Age : from 20 to 90 y/o.

Annotated entities:
- Person: "Age"
- Value: "20 to 90 y/o"